下列關於不停跳冠狀動脈繞道手術（off-pump coronary artery bypass grafting）的敘述，何者正確？①須使用heparin ②人工心肺機不需待命 ③不須降低體溫 ④不會引發腦中風
A. ①②③
B. 僅①③
C. ②④
D. 僅④

正確答案：B. 僅①③